Clinical trial exclusion criterion:
Contraindication to Aspirin

Annotated entities:
- Condition: "Contraindication"
- Drug: "Aspirin"